Clinical trial inclusion criterion:
Oswestry Questionnaire score of at least 40/100 at baseline.

Entity relations:
- Has_value("Oswestry Questionnaire score", "at least 40/100")
- Has_temporal("Oswestry Questionnaire score", "at baseline")